可以取代 dapsone，治療癩病且血漿中半衰期長達 2 個月之藥物為：
A. rifampin
B. ethambutol
C. clofazimine
D. cycloserine

正確答案：C. clofazimine